Severe hepatitis activity as documented by ALT>10 x ULN

The above is a clinical trial exclusion criterion. Annotated with entity spans:
[Qualifier: Severe] [Condition: hepatitis] activity as documented by [Measurement: ALT][Value: >10 x ULN]